List R packages for lipidomics

Lipidomics, masspix, lipidms, lipidr and lipid mini-on are R packages for lipidomics.